El término “Biodisponibilidad absoluta” hace referencia a:
1. La fracción o porcentaje de dosis de fármaco que tras ser administrado en una determinada forma farmacéutica accede inalterada a la biofase en comparación con un preparado intravenoso del mismo.
2. La fracción o porcentaje de dosis de fármaco que tras ser administrado en una determinada forma farmacéutica accede inalterada a la circulación sistémica en comparación con un preparado patrón del mismo.
3. La fracción o porcentaje de dosis de fármaco que tras ser administrado en una determinada forma farmacéutica accede inalterada a la circulación sistémica en comparación con un preparado intravenoso del mismo.
4. Que el 100% de la dosis de fármaco administrado en una determinada forma farmacéutica accede inalterada a la circulación general.
5. La fracción o porcentaje de dosis de fármaco que tras ser administrado en una determinada forma farmacéutica accede inalterada al lugar de absorción en comparación con un preparado estándar del mismo.

Respuesta correcta: 3. La fracción o porcentaje de dosis de fármaco que tras ser administrado en una determinada forma farmacéutica accede inalterada a la circulación sistémica en comparación con un preparado intravenoso del mismo.